Clinical trial exclusion criterion:
Human immunodeficiency virus (HIV) or human immunodeficiency virus (AIDS)

Annotated entities:
- Condition: "Human immunodeficiency virus (HIV)"
- Condition: "human immunodeficiency virus (AIDS)"